Clinical trial inclusion criterion:
Patient eligible for transradial and transfemoral primary percutaneous coronary intervention, being pre-requisites: (a) familiarity of the operator with the radial and femoral techniques using vascular closure devices, (b) agreement of the operator to use the access route determined by the randomization process.

Entity relations:
- Has_qualifier("percutaneous coronary intervention", "primary")
- Has_qualifier("percutaneous coronary intervention", "transradial")
- Has_mood("percutaneous coronary intervention", "eligible for")
- OR("transradial", "transfemoral")